對於醫師診斷為不可治癒的癌症末期病患，在病人清醒情況下，根據安寧緩和醫療條例，下列那項要求合法？
A. 病人要求放棄施行心肺復甦術
B. 未經病人同意，家屬要求放棄施行心肺復甦術
C. 病人請醫師給予藥物以提早結束生命及痛苦
D. 違反病人放棄施行心肺復甦術的意願，家人請求醫師全力救治，包括心肺復甦術

正確答案：A. 病人要求放棄施行心肺復甦術